Clinical trial exclusion criterion:
6. Hematocrit < 0.30

Entity relations:
- Has_value("Hematocrit", "< 0.30")